Clinical trial exclusion criterion:
Clinically diagnosed Cushing's disease, acromegaly, gigantism

Entity relations:
- Has_qualifier("Cushing's disease", "Clinically diagnosed")
- OR("Cushing's disease", "gigantism", "acromegaly")